Están directamente implicados en las reacciones alérgicas:
1. Linfocitos T.
2. Células dendríticas.
3. Monocitos.
4. Plaquetas.
5. Mastocitos.

Respuesta correcta: 5. Mastocitos.